Clinical trial exclusion criterion:
communication or cognitive deficits with mini-mental state examination, (MMSE) <24/30 (Folstein et al., 1975);

Annotated entities:
- Condition: "cognitive deficits"
- Measurement: "mini-mental state examination, (MMSE)"
- Value: "<24/30"
- Condition: "communication deficits"